Describe RCandy

RCandy is a platform-independent R package for rapid, simple, and flexible visualisation of recombination events in bacterial genomes.